Pediatric patients (under 18 years) Pregnancy Patients who are unresponsive at baseline, who have neurologic deficits at baseline, or who are allergic to dexmedetomidine

The above is a clinical trial exclusion criterion. Annotated with entity spans:
[Line: Pediatric patients (under 18 years)] [Condition: Pregnancy] [Line: Patients who are unresponsive at baseline, who have neurologic deficits at baseline, or who are allergic to dexmedetomidine]